participation in another investigational drug study

The above is a clinical trial inclusion criterion. Annotated with entity spans:
[Post-eligibility: participation in another investigational drug study]